Patient with high risk of bleeding as defined by (1) HASBLED score =3 OR (2) HASBLED = CHADS2VASC score, OR (3) recent history of severe bleeding (type 3a, 3b, 3c), particularly cerebral or gastrointestinal, OR (4) prior recurrent (>2) history of falls.

The above is a clinical trial inclusion criterion. Annotated with entity spans:
Patient with [Qualifier: high] [Observation: risk of bleeding] as defined by (1) [Measurement: HASBLED score] [Value: =3] OR (2) HASBLED = [Measurement: CHADS2VASC score], OR (3) recent history of [Condition: severe bleeding] ([Qualifier: type 3a, 3b, 3c]), particularly [Qualifier: cerebral] or [Qualifier: gastrointestinal], OR (4) prior [Qualifier: recurrent] ([Multiplier: >2]) history of [Observation: falls].